Taking acetylsalicylic acid (ASA) 100 mg daily treatment for at least 7 days or taking ASA 100 mg daily dose for less than 7 days but with 300 mg ASA loading dose before PCI.

The above is a clinical trial inclusion criterion. Annotated with entity spans:
Taking [Drug: acetylsalicylic acid] ([Drug: ASA]) [Multiplier: 100 mg] [Multiplier: daily] treatment [Temporal: for at least 7 days] or taking [Drug: ASA] [Multiplier: 100 mg] [Multiplier: daily] dose [Temporal: for less than 7 days] but with [Multiplier: 300 mg] [Drug: ASA] loading dose [Temporal: before PCI].